Clinical trial exclusion criterion:
Chronic use of vitamin K antagonists or direct thrombin inhibitors, or oral Xa-factor antagonists;

Entity relations:
- Has_multiplier("vitamin K antagonists", "Chronic")
- OR("vitamin K antagonists", "direct thrombin inhibitors", "oral Xa-factor antagonists")